Clinical trial inclusion criterion:
Fluent in reading and writing in English language.

Annotated entities:
- Non-query-able: "Fluent in reading and writing in English language."